Written informed consent

The above is a clinical trial inclusion criterion. Annotated with entity spans:
[Non-query-able: Written informed consent]